一早產兒發生動脈導管閉鎖不全，可以使用下列何種藥物來使其關閉？
A. diclofenac
B. ibuprofen
C. rofecoxib
D. sulindac

正確答案：B. ibuprofen